Clinical trial exclusion criterion:
non-genotype 4

Entity relations:
- Has_negation("genotype 4", "non")